約多少比例的癲癇患者用抗癲癇藥物（anticonvulsants）可以控制得很好或不發作？
A. 小於 30%
B. 30-40%
C. 60-70%
D. 大於 90%

正確答案：C. 60-70%